fluent in English or Spanish

The above is a clinical trial inclusion criterion. Annotated with entity spans:
[Observation: fluent in English] or Spanish